Clinical trial inclusion criterion:
Can achieve best corrected spectacle distance visual acuity of 20/25 (0.10 logMAR) or better in each eye.

Annotated entities:
- Measurement: "best corrected spectacle distance visual acuity"
- Value: "20/25 or better"
- Value: "0.10 logMAR or better"